Clinical trial inclusion criterion:
55 years of age or older at time of randomization;

Annotated entities:
- Value: "55 years or older"
- Person: "age"
- Temporal: "at time of randomization"